Being in good health, with no significant medical history;

The above is a clinical trial inclusion criterion. Annotated with entity spans:
[Subjective_judgement: Being in good health, with no significant medical history;]